工人的白指病是由於下列何種工作或暴露所引起的？
A. 振動工作
B. 苯作業
C. 甲苯作業
D. 微波作業

正確答案：A. 振動工作